Clinical trial inclusion criterion:
Male or female 18 years or older

Entity relations:
- Has_value("years or older", "18 years or older")
- OR("Male", "female")